Clinical trial exclusion criterion:
Hemochromatosis, iron overload, defined as TSAT > 45%

Annotated entities:
- Condition: "Hemochromatosis"
- Condition: "iron overload"
- Measurement: "TSAT"
- Value: "> 45%"